Clinical trial exclusion criterion:
8. Has an IUD in place

Annotated entities:
- Parsing_Error: "8."
- Device: "IUD"